Stated willingness to comply with all study procedures and availability for the duration of the study

The above is a clinical trial inclusion criterion. Annotated with entity spans:
[Post-eligibility: Stated willingness to comply with all study procedures and availability for the duration of the study]